Clinical trial exclusion criterion:
Unstable/rapidly progressing renal disease or estimated Glomerular Filtration Rate < 60 mL/min (Cockcroft-Gault formula).

Entity relations:
- Has_value("estimated Glomerular Filtration Rate", "< 60 mL/min")
- Has_qualifier("estimated Glomerular Filtration Rate", "Cockcroft-Gault formula")
- Has_qualifier("renal disease", "Unstable")
- OR("Unstable", "rapidly progressing")
- OR("renal disease", "estimated Glomerular Filtration Rate")